Clinical trial inclusion criterion:
Ulcers whose major axis measured with the electronic caliper is ≥ 2 mm

Annotated entities:
- Condition: "Ulcers"
- Measurement: "major axis"
- Value: "≥ 2 mm"
- Qualifier: "measured with the electronic caliper"